化學治療時造成的落髮原因中，最常見的是下列何者？
A. 圓禿（alopecia areata）
B. 休止期落髮（telogen effluvium）
C. 生長期落髮（anagen effluvium）
D. 腫瘤性禿髮（alopecia neoplastica）

正確答案：C. 生長期落髮（anagen effluvium）